Clinical trial inclusion criterion:
Patients meeting the Rotterdam PCOS workshop criteria for polycystic ovary syndrome, defined by oligomenorrhea or amenorrhea and at least one of the following two signs: clinical or biochemical evidence of hyperandrogenism or ultrasound finding of polycystic appearing ovaries.

Annotated entities:
- Measurement: "Rotterdam PCOS workshop criteria for polycystic ovary syndrome"
- Value: "meeting"
- Condition: "oligomenorrhea"
- Condition: "amenorrhea"
- Multiplier: "at least one"
- Condition: "hyperandrogenism"
- Condition: "polycystic ovaries"
- Procedure: "ultrasound"